下列那一個器官最容易發生液化性壞死（Liquefactive necrosis）？
A. 肺
B. 腎
C. 腸
D. 腦

正確答案：D. 腦